Clinical trial exclusion criterion:
Patient refusal.

Annotated entities:
- Post-eligibility: "Patient refusal"